Clinical trial exclusion criterion:
History of hypersensitivity to proteins (e.g., allergy shots).

Annotated entities:
- Condition: "hypersensitivity to proteins"
- Condition: "hypersensitivity to allergy shots"
- Temporal: "History"